¿Para qué trastorno de la ingestión y de la conducta alimentaria de la infancia se recomienda el uso de procedimientos de práctica masiva?:
1. La pica.
2. La bulimia nerviosa.
3. La rumiación.
4. La anorexia infantil.
5. El trastorno de la ingestión alimentaria de la infancia y la niñez.

Respuesta correcta: 3. La rumiación.